Clinical trial inclusion criterion:
2. Screening tool: History. Government-issued forms of identification (e.g. driver s license, birth certificate) will be required when participant appears to be out of age range.

Annotated entities:
- Parsing_Error: "2."
- Temporal: "History"
- Not_a_criteria: "Government-issued forms of identification (e.g. driver s license, birth certificate) will be required when participant appears to be out of age range."